有關大腸直腸癌治療的敘述，下列何者錯誤？
A. 手術切除是治療癌症的最有效方法
B. 低位直腸癌的患者，術前接受放射線治療可降低局部復發率
C. 手術後，對於第 III 期大腸癌之患者給予輔助性化學藥物治療，可提高存活率
D. T2期之直腸癌最佳的治療方式是局部切除、保存肛門

正確答案：D. T2期之直腸癌最佳的治療方式是局部切除、保存肛門